根據世界衛生組織之定義，神經症狀必須持續多久，才能診斷為腦中風？
A. 6 小時
B. 12 小時
C. 24 小時
D. 48 小時

正確答案：C. 24 小時